Are pregnant

The above is a clinical trial exclusion criterion. Annotated with entity spans:
Are [Condition: pregnant]